大量輸血（Massive transfusion）後，會造成血液之酸鹼值何種變化？
A. 酸性血症
B. 鹼性血症
C. 不變
D. 不一定

正確答案：B. 鹼性血症